Clinical trial exclusion criterion:
are allergic to influenza vaccination

Entity relations:
- AND("allergic", "influenza vaccination")